definite radiographic evidence of osteoarthritis of the glenohumeral joint

The above is a clinical trial exclusion criterion. Annotated with entity spans:
[Qualifier: definite] [Mood: radiographic evidence] of [Condition: osteoarthritis] of the [Qualifier: glenohumeral joint]